Which are the cardiac effects of thyronamines?

Thyronamines have negative chronotropy, negative inotropy; in particular thyronamines are considered negative inotropic agents